Clinical trial exclusion criterion:
Patients with any other severe concurrent disease, which in the judgment of the investigator, would make the patient inappropriate for entry into this study.

Entity relations:
- Has_qualifier("concurrent disease", "severe")
- Has_mood("entry into this study", "inappropriate for")
- Has_context("concurrent disease", "entry into this study")